如果脊髓受損（spinal cord injury）患者的主要損傷部位在背側之脊髓神經束（dorsal column），下列何者最不可能發生？
A. 閉眼時無法正確辨識手掌中的物體
B. 震動感覺（vibratory sense）較差
C. 無法正確偵測皮膚上的溫度變化
D. 閉眼時無法站穩

正確答案：C. 無法正確偵測皮膚上的溫度變化